許多腸道病原體感染，亦會產生腸道外疾病，下列那一種病原體與腸道外疾病的組合錯誤？
A. Shigella- glomerulonephritis
B. Campylobacter- immunoglobulin A（IgA）nephropathy
C. rotavirus- reactive arthritis
D. Yersinia- hemolytic anemia

正確答案：C. rotavirus- reactive arthritis